Subjects who, in the opinion of the investigator, can and will comply with the requirements of the protocol.

The above is a clinical trial inclusion criterion. Annotated with entity spans:
Subjects who, [Non-query-able: in the opinion of the investigator], can and will [Observation: comply with the requirements of the protocol].